A history of penetrating ocular trauma in the study eye.

The above is a clinical trial exclusion criterion. Annotated with entity spans:
A [Temporal: history of] [Condition: penetrating ocular trauma] [Qualifier: in the study eye].